What is the genetic basis of Ohdo syndrome?

Mutations in MED12 cause X-linked Ohdo syndrome